Clinical trial inclusion criterion:
a very high cardiovascular risk and LDL-cholesterol> 1.8 mmol / l

Annotated entities:
- Condition: "cardiovascular risk"
- Qualifier: "very high"
- Measurement: "LDL-cholesterol"
- Value: "> 1.8 mmol / l"